Clinical trial inclusion criterion:
2. Women of childbearing potential must practice abstinence or be using an acceptable form of contraception throughout the duration of the study. Acceptable forms of contraception include the following:

Annotated entities:
- Person: "Women"
- Condition: "childbearing potential"
- Procedure: "abstinence"
- Qualifier: "acceptable form"
- Procedure: "contraception"
- Temporal: "throughout the duration of the study"